王女士47歲，接受乳癌篩檢，被告知左側乳房有異常，接受病灶穿刺病理檢查證實為乳癌，她與主治醫師討論後續的手術治療選擇，下列敘述何者錯誤？
A. 選擇乳房全切除手術或乳房保留手術合併輔助治療，兩者在存活率上並沒有太大差別
B. 乳房保留手術者相對於全切除者，在同側乳房有較高的局部復發率
C. 乳房保留手術的邊緣只要能乾淨無虞（clear margins），是否有非典型增生或小葉原位癌
D. 乳房切除術後接受乳房重建手術最好間隔兩年，因為即時的重建手術（immediate reconstruction）會降低存活率與增加局部復發

正確答案：D. 乳房切除術後接受乳房重建手術最好間隔兩年，因為即時的重建手術（immediate reconstruction）會降低存活率與增加局部復發